Clinical trial exclusion criterion:
Left ventricular ejection fraction (LVEF) below 50% within approximately 28 days prior to randomization.

Entity relations:
- Has_value("Left ventricular ejection fraction (LVEF)", "below 50%")
- Has_index("within approximately 28 days prior to randomization", "randomization")
- Has_temporal("Left ventricular ejection fraction (LVEF)", "within approximately 28 days prior to randomization")